Which R / bioconductor package is used for enrichment analysis of genomic regions?

locus overlap analysis (lola) provides easy and automatable enrichment analysis for genomic region sets, thus facilitating the interpretation of functional genomics and epigenomics data.